Clinical trial exclusion criterion:
Addition of trocar(s) or conversion of surgery to hand-assisted or open

Entity relations:
- multi("conversion of surgery", "surgery")
- Has_mood("trocar", "Addition of")
- AND("conversion of surgery", "hand-assisted")
- OR("hand-assisted", "open")
- OR("trocar", "conversion of surgery")